Al realizar un electrocardiograma observará que el complejo QRS es predominantemente negativo en la derivación:
1. V1.
2. AVF.
3. V5.
4. V6.
5. DIII.

Respuesta correcta: 1. V1.